7. Acute or chronic renal dysfunction (creatinine greater than 2.5 mg/dl or less than 150µmol/L).

The above is a clinical trial exclusion criterion. Annotated with entity spans:
7. [Condition: Acute] or [Condition: chronic renal dysfunction] ([Measurement: creatinine] [Value: greater than 2.5 mg/dl] or [Value: less than 150µmol/L]).